Clinical trial exclusion criterion:
Has a known history of, or any evidence of, central nervous system (CNS) metastases and/or carcinomatous meningitis

Annotated entities:
- Temporal: "history"
- Observation: "evidence"
- Condition: "central nervous system (CNS) metastases"
- Condition: "carcinomatous meningitis"